Que coenzima se utiliza en las reacciones de transaminación de los aminoácidos:
1. FAD.
2. Biotina.
3. Piridoxal.
4. NAD+.
5. NADP+.

Respuesta correcta: 3. Piridoxal.